下列關於原發性腦瘤（primary brain tumor）的敘述，何者錯誤？
A. glioma中，惡性度最高的是glioblastoma multiforme（GBM）
B. ependymoma好發於老年人
C. medulloblastoma是孩童primary brain tumor最常見的種類
D. medulloblastoma可能隨	CSF轉移至中樞神經系統的其他位置

正確答案：B. ependymoma好發於老年人